關於創傷性脊椎損傷的敘述，下列何者錯誤？
A. C3 以上的受傷通常會導致窒息（apnea）
B. C3～5 間的受傷剛開始會有好的呼吸，但是會因為疲勞和無法清除分泌物而衰竭
C. 肩部無法外展（shoulder abduction impairment）通常是 C7 nerve root 受傷
D. low spinal cord injury 的檢查包括 anal sphincter tone，anal wink 和 bulbocavernosus reflex

正確答案：C. 肩部無法外展（shoulder abduction impairment）通常是 C7 nerve root 受傷